How is connected "isolated Non-compaction cardiomyopathy" with dilated cardiomyopathy?

Mutations in cardiac beta-myosin heavy chain and alpha-tropomyosin link isolated Non-compaction cardiomyopathy with dilated cardiomyopathy